What does a PET (Positron Excitation Tomography) measure?

Positron Excitation Tomography (PET) is a method that allows for quantitative assessment of brain injury conditions such as multiple system atrophy.